30歲的婦女，產前7天的血壓正常，血液肌酸酐 0.6 mg/dL。產後當天有出血、高血壓、少尿、水腫。理學檢 查皮膚沒有紅斑或紫斑，血液Hb 8.0 g/dL，血小板70,000/mm3，血液抹片有fragmented RBCs，
 haptoglobin下降，BUN 100 mg/dL，肌酸酐3.6 mg/dL，尿液osmolality 400 mOsmol/kg H2O，尿液Na+ 10 
 mmol/L，尿液紅血球20～30/HPF，尿液蛋白質trace。最可能的診斷是：
A. 急性腎小管壞死（acute tubular necrosis）
B. 溶血性尿毒症候群（hemolytic uremic syndrome）
C. Goodpasture氏症候群
D. 冷凝球蛋白血症（cryoglobulinemia）

正確答案：B. 溶血性尿毒症候群（hemolytic uremic syndrome）